6. patient considered surgery but decided to wait and/or refused surgery -

The above is a clinical trial inclusion criterion. Annotated with entity spans:
6. [Parsing_Error: patient considered surgery but decided to wait and/or refused surgery -]